Is PPROM a condition that occurs in males or females?

Preterm premature rupture of fetal membranes (PPROM) occurs in pregnant females.